Clinical trial inclusion criterion:
Venous pH less than 7.25

Annotated entities:
- Measurement: "Venous pH"
- Value: "less than 7.25"